依據醫療法之規定，人體試驗之病歷應該保存幾年？
A. 7 年
B. 10 年
C. 20 年
D. 永久保存

正確答案：D. 永久保存